Clinical trial inclusion criterion:
No treatment with insulin or oral agents for 6 months

Annotated entities:
- Negation: "No"
- Procedure: "treatment"
- Drug: "insulin"
- Drug: "oral agents"
- Temporal: "for 6 months"